Clinical trial inclusion criterion:
Patients who are able to perform SD-OCT

Entity relations:
- Has_mood("SD-OCT", "able to perform")